16. Childbearing-aged female subject who is unmarried or dose not bear child;

The above is a clinical trial exclusion criterion. Annotated with entity spans:
16. Childbearing-aged [Person: female] subject who is [Observation: unmarried] or dose [Negation: not] [Observation: bear child];